Clinical trial exclusion criteria:
History of recurrent UTI (defined as three culture proven UTIs within last 12 months)
Systemic neuromuscular disease known to affect the lower urinary tract
Undergoing concomitant prolapse surgery
Previous incontinence surgery
Treatment with anticholinergic medication in the last 2 months
Previous bladder injection with onabotulinumtoxinA
Prisoner Status
Pregnancy

Annotated entities:
- Condition: "recurrent UTI"
- Multiplier: "three"
- Measurement: "culture"
- Temporal: "within last 12 months"
- Condition: "neuromuscular disease"
- Procedure: "prolapse surgery"
- Procedure: "incontinence surgery"
- Drug: "anticholinergic medication"
- Temporal: "last 2 month"
- Qualifier: "bladder injection"
- Drug: "onabotulinumtoxinA"
- Person: "Prisoner"
- Condition: "Pregnancy"